List orally bioavailable MPS1 kinase inhibitors

1 h-pyrrolo [3,2-c] pyridine, cct271850, nms-p715, 4-aminopyrazolo, bos172722 and cct251455 are orally bioavailable MPS1 kinase inhibitors.